Clinical trial exclusion criterion:
Emergency surgery

Annotated entities:
- Procedure: "Emergency surgery"
- Visit: "Emergency"